Clinical trial exclusion criterion:
Treatment with cholestyramine or colestipol

Annotated entities:
- Drug: "cholestyramine"
- Drug: "colestipol"
- Procedure: "Treatment"